De acuerdo con el Real Decreto 1093/2010 de 3 de septiembre, por el que se aprueba el conjunto mínimo de datos de los informes clínicos en el Sistema Nacional de Salud, señale la afirmación INCORRECTA:
1. Tiene por objeto el establecimiento del conjunto mínimo de datos que deberán contener los documentos clínicos en cualquiera que sea el soporte, electrónico o papel.
2. Acerca del informe de cuidados de enfermería, se indica que el modelo enfermero obligatorio para guiar la valoración es el propuesto por Virginia Henderson.
3. En el informe de cuidados de enfermería deben aparecer, en los diagnósticos enfermeros activos, literal NANDA con su código.
4. En la historia clínica resumida deben aparecer, en los diagnósticos enfermeros activos, literal NANDA con su código.

Respuesta correcta: 2. Acerca del informe de cuidados de enfermería, se indica que el modelo enfermero obligatorio para guiar la valoración es el propuesto por Virginia Henderson.